Caracteriza a los puentes de hidrógeno presentes en la hélice alfa el:
1. Formarse entre cadenas polipeptídicas adyacentes.
2. Establecerse entre grupos amino y carbonilo de los enlaces peptídicos.
3. Implicar a grupos cargados positiva y negativamente.
4. Establecerse entre grupos de cadenas laterales.

Respuesta correcta: 2. Establecerse entre grupos amino y carbonilo de los enlaces peptídicos.